Any other reason, which in the opinion of the Investigator would confound proper evaluation of the study.

The above is a clinical trial exclusion criterion. Annotated with entity spans:
[Subjective_judgement: Any other reason, which in the opinion of the Investigator would confound proper evaluation of the study.]